La acatisia que producen algunos fármacos está directamente relacionada con el bloqueo de receptores:
1. Dopaminérgicos.
2. Serotoninérgicos.
3. Histaminérgicos.
4. Adrenérgicos.
5. Colinérgicos.

Respuesta correcta: 1. Dopaminérgicos.